Clinical trial inclusion criterion:
Adult (= 18 years old) subjects with chronic genotype 1 HCV and NCI with a GDS greater than or equal to 0.5 (n=60).

Entity relations:
- Has_value("old", "= 18 years old")
- Subsumes("Adult", "old")
- Has_value("GDS", "greater than or equal to 0.5")
- Has_qualifier("HCV", "genotype 1")
- Has_temporal("HCV", "chronic")
- AND("HCV", "GDS")
- OR("HCV", "NCI")